History of being treated for tuberculosis in the prior 2 years unless there is DST, including PCR testing, showing sensitivity to rifamycin.

The above is a clinical trial exclusion criterion. Annotated with entity spans:
History of being [Procedure: treated] for [Condition: tuberculosis] [Temporal: in the prior 2 years] unless there is [Condition: DST], including [Procedure: PCR testing], showing [Condition: sensitivity] to [Drug: rifamycin].